Clinical trial exclusion criterion:
Pregnant woman with infection of human immunodeficiency virus or hepatitis C virus

Entity relations:
- OR("human immunodeficiency virus", "hepatitis C virus")